4. Oral temperature > 38 C

The above is a clinical trial inclusion criterion. Annotated with entity spans:
[Parsing_Error: 4.] [Measurement: Oral temperature] [Value: > 38 C]